coagulopathy

The above is a clinical trial exclusion criterion. Annotated with entity spans:
[Condition: coagulopathy]